Clinical trial exclusion criterion:
Patients with persistent stone burden following definitive surgical therapy.

Annotated entities:
- Qualifier: "persistent"
- Observation: "stone burden"
- Temporal: "following definitive surgical therapy"
- Reference_point: "definitive surgical therapy"
- Procedure: "definitive surgical therapy"